有關睪丸的精細胞瘤（seminoma）之敘述，下列何者錯誤？
A. 類似腫瘤也可發生在卵巢或中樞神經系統
B. 常發生在嬰兒
C. 是對放射治療敏感的腫瘤
D. 腫瘤細胞通常不含α-fetoprotein

正確答案：B. 常發生在嬰兒